有關Trisomy18（Edwards syndrome）的敘述，下列何者錯誤？
A. 第2指交疊於第3指，第5指交疊於第4指
B. 短胸骨（short sternum）
C. 搖椅腳（rocker-bottom feet）
D. 扁平枕部（flat occiput）

正確答案：D. 扁平枕部（flat occiput）